Clinical trial exclusion criterion:
history of hypersensitivity to test drugs

Annotated entities:
- Temporal: "history of"
- Condition: "hypersensitivity"
- Drug: "test drugs"